Clinical trial exclusion criterion:
Presence of clinically significant (grade 2-4) anterior segment abnormalities

Annotated entities:
- Qualifier: "clinically significant"
- Subjective_judgement: "clinically significant"
- Qualifier: "grade 2-4"
- Value: "2-4"
- Condition: "anterior segment abnormalities"
- Context_Error: "anterior segment abnormalities"